Clinical trial exclusion criterion:
With multiple sclerosis or other progressive neurological disease

Annotated entities:
- Condition: "multiple sclerosis"
- Condition: "progressive neurological disease"